Clinical trial inclusion criterion:
Tissue from tumor must be available. This may be paraffin embedded tissue from previous biopsy/resection or if it is not available, a repeat biopsy must be performed. The requirement for biopsy may be waived if alpha-fetoprotein is greater than 500 ng/mL and in the investigators opinion not explained by a concurrent hepatic inflammatory process.

Annotated entities:
- Procedure: "biopsy"
- Measurement: "alpha-fetoprotein"
- Value: "greater than 500 ng/mL"